有關佝僂病（rickets）及骨軟化病（osteomalacia）的敘述，下列何者錯誤？
A. 皆是生長板（growth plate）中增生區（proliferative zone）之骨礦物化（bone mineralization）失	所導致
B. 血清中副甲狀腺素（parathyroid hormone）及鹼性磷酸酶（alkaline phosphatase）都會升高
C. 負荷重量的長骨之X光片影像中，皆可常見Looser氏轉型區（Looser's transformation zone）的變化
D. 確切的診斷依據皆是骨活體組織切片

正確答案：A. 皆是生長板（growth plate）中增生區（proliferative zone）之骨礦物化（bone mineralization）失	所導致